Patients must be at least 18 years of age.

The above is a clinical trial inclusion criterion. Annotated with entity spans:
Patients must be [Value: at least 18 years] of [Person: age].